Un método industrial muy importante para la formación de enlaces carbono-nitrógeno es la transposición de Beckman, una reacción que transforma:
1. Una cetona en una piridina.
2. Una oxima en una amina.
3. Un aldehído en una amida.
4. Una cetona en una amida.
5. Una oxima en una amida.

Respuesta correcta: 5. Una oxima en una amida.